Clinical trial inclusion criterion:
Smoke on = 25 days of the past 30 days

Entity relations:
- Has_multiplier("Smoke", "= 25 days of the past 30 days")